Colonoscopy scheduled to be undertaken peroperatively

The above is a clinical trial exclusion criterion. Annotated with entity spans:
[Procedure: Colonoscopy] [Mood: scheduled] to be [Procedure: undertaken] [Temporal: peroperatively]